Clinical trial exclusion criterion:
5. Nursing women

Annotated entities:
- Parsing_Error: "5."
- Person: "women"
- Condition: "Nursing"